Clinical trial exclusion criterion:
Suspected cobra bite, OR

Annotated entities:
- Condition: "cobra bite"
- Mood: "Suspected"